下列有關一位新生男嬰兒罹患單純大血管轉位（TGA with intact ventricular septum）之處理，何者為錯？
A. 給予 prostaglandin E1，維持開放性動脈導管（PDA）暢通
B. 給予氣球心房造口術（balloon atrioseptostomy）
C. 維持體溫，矯正酸血症或低血糖
D. 提高開刀成功率，建議一個月大後，方實行大血管轉位手術

正確答案：D. 提高開刀成功率，建議一個月大後，方實行大血管轉位手術